Clinical trial exclusion criterion:
Serum creatinine level >120 umol/ml for men and >105 umol/ml for women at screening.

Annotated entities:
- Measurement: "Serum creatinine level"
- Value: ">120 umol/ml"
- Person: "men"
- Value: ">105 umol/ml"
- Person: "women"
- Temporal: "at screening"